Clinical trial exclusion criterion:
Cardiac or peripheral arterial disease

Entity relations:
- OR("peripheral arterial disease", "disease Cardiac")